Clinical trial inclusion criterion:
Age 18-65

Annotated entities:
- Person: "Age"
- Value: "18-65"